Clinical trial exclusion criterion:
Any treatment directed against active tuberculosis within 6 months preceding initiation of study drugs.

Annotated entities:
- Qualifier: "active"
- Condition: "tuberculosis"
- Temporal: "within 6 months preceding initiation of study drugs"
- Procedure: "treatment"